一位 28 歲女性，月經周期 2-3 個月，外觀上有多毛症，青春痘，下列何項檢查對診斷的幫助最小？
A. FSH（follicle-stimulating hormone）
B. LH（luteinizing hormone）
C. testosterone
D. TSH（thyroid-stimulating hormone）

正確答案：D. TSH（thyroid-stimulating hormone）